Clinical trial inclusion criterion:
Agrees not to donate blood to a blood bank throughout participation in the study and for at least 3 months after last study day

Annotated entities:
- Non-query-able: "grees not to donate blood to a blood bank throughout participation in the study and for at least 3 months after last study day"